choroidal neovascularization caused by other eye diseases

The above is a clinical trial exclusion criterion. Annotated with entity spans:
[Condition: choroidal neovascularization] caused by [Condition: other eye diseases]